¿Cuál de las siguientes vacunas está contraindicada en pacientes inmunodeprimidos?:
1. Varicela.
2. Hepatitis B.
3. Gripe.
4. Neumocócica (polisacáridos).

Respuesta correcta: 1. Varicela.